Evidence of an active gastrointestinal or urogenital bleeding

The above is a clinical trial exclusion criterion. Annotated with entity spans:
Evidence of an [Temporal: active] [Condition: gastrointestinal] or [Condition: urogenital bleeding]